Clinical trial exclusion criterion:
Subject has cauda equina syndrome or neurogenic bowel/bladder dysfunction.

Annotated entities:
- Condition: "cauda equina syndrome"
- Condition: "neurogenic bowel dysfunction"
- Condition: "neurogenic bladder dysfunction"